Clinical trial exclusion criterion:
12. Hypersensitivity to caffeine, warfarin, vitamin K, omeprazole, dextromethorphan, midazolam, tipranavir, ritonavir or their excipients

Annotated entities:
- Parsing_Error: "12."
- Drug: "caffeine"
- Drug: "warfarin"
- Drug: "vitamin K"
- Drug: "omeprazole"
- Drug: "dextromethorphan"
- Drug: "midazolam"
- Drug: "tipranavir"
- Drug: "ritonavir"
- Condition: "Hypersensitivity"